Patients with informed consents

The above is a clinical trial inclusion criterion. Annotated with entity spans:
[Informed_consent: Patients with informed consents]